Clinical trial exclusion criterion:
(6)Significant signs of abnormalities as seen in laboratory tests or physical characteristics, which, at the discretion of the investigators, indicates that the patient is experiencing a serious illness or, may affect the observation and evaluation of the drug's efficacy or adverse events, or renders the patient unsuitable for participating in this study;

Annotated entities:
- Qualifier: "Significant"
- Condition: "signs of abnormalities"
- Measurement: "laboratory tests"
- Non-representable: "or physical characteristics, which, at the discretion of the investigators, indicates that the patient is experiencing a serious illness or, may affect the observation and evaluation of the drug's efficacy or adverse events, or renders the patient unsuitable for participating in this study;"